Presence of orthodontic devices.

The above is a clinical trial exclusion criterion. Annotated with entity spans:
Presence of [Device: orthodontic devices].